Un paciente sufre una infección por Pseudomonas aeruginosa. ¿Cuál de las siguientes penicilinas sería de su elección?
1. Amoxicilina+Ácido clavulánico.
2. Cloxacilina.
3. Penicilina V.
4. Piperacilina-tazobactam.
5. Ampicilina.

Respuesta correcta: 4. Piperacilina-tazobactam.